Clinical trial exclusion criterion:
Sensitivity to pilocarpine

Entity relations:
- AND("Sensitivity", "pilocarpine")